Clinical trial exclusion criterion:
Severe erosive esophagitis, severe esophageal stricture, active gastric or duodenal ulcer

Annotated entities:
- Condition: "erosive esophagitis"
- Condition: "esophageal stricture"
- Condition: "duodenal ulcer"
- Condition: "gastric ulcer"
- Qualifier: "active"
- Qualifier: "severe"
- Qualifier: "Severe"